Clinical trial inclusion criterion:
No contraindications for mifepristone or misoprostol

Entity relations:
- Has_mood("mifepristone", "contraindications for")
- Has_negation("contraindications for", "No")
- OR("mifepristone", "misoprostol")